甲狀腺機能低下不會發生何種現象？
A. T3↓
B. 膽固醇（cholesterol）↓
C. TSH↑
D. 黏液水腫（myxedema）

正確答案：B. 膽固醇（cholesterol）↓